Un procedimiento de modelado que combina exposición y actuación del modelo, instigadores verbales y físicos, ensayo de conducta y desensibilización in vivo, se denomina:
1. Modelado in vivo.
2. Modelado pasivo.
3. Modelado participante.
4. Modelado simbólico.

Respuesta correcta: 3. Modelado participante.